Clinical trial inclusion criterion:
3. self-reported AT-related pain for at least 6 months and VAS (Visual Analog Scale) pain >5 (0-10 scale)

Annotated entities:
- Condition: "AT-related pain"
- Observation: "self-reported"
- Temporal: "for at least 6 months"
- Measurement: "VAS (Visual Analog Scale) pain"
- Value: ">5"
- Qualifier: "0-10 scale"